下列何者不是重複三核苷酸型異常（trinucleotide-repeat disorder）？
A. 亨丁頓氏病（Huntington's disease）
B. 馬卡多-約瑟夫氏病（Machado-Joseph disease）
C. 甘迺迪病（Kennedy's disease）
D. 阿茲海默症（Alzheimer's disease）

正確答案：D. 阿茲海默症（Alzheimer's disease）